any presence of serious medical conditions ( esp. cardiac, renal, liver diseases)

The above is a clinical trial exclusion criterion. Annotated with entity spans:
any presence of [Condition: serious medical conditions] ( esp. [Condition: cardiac], [Condition: renal], [Condition: liver diseases])